Have a good clinical response to TB.

The above is a clinical trial inclusion criterion. Annotated with entity spans:
Have a [Condition: good clinical response] to [Condition: TB].